有關腹股溝管（inguinal canal）的敘述，下列何者正確？
A. 男性腹股溝管通過精索（spermatic cord），女性通過卵巢韌帶（ligament of the ovary）
B. 胚胎期間，鞘突（vaginal process）只發生在男性個體
C. 發生在管內的疝氣，稱為直接型腹股溝疝氣（direct inguinal hernia）
D. 腹橫筋膜（transversalis fascia）圍成腹股溝管深環（deep inguinal ring）頂部的外側1/3

正確答案：D. 腹橫筋膜（transversalis fascia）圍成腹股溝管深環（deep inguinal ring）頂部的外側1/3